Inflammatory arthritis or diabetes,

The above is a clinical trial exclusion criterion. Annotated with entity spans:
[Condition: Inflammatory arthritis] or [Condition: diabetes],